Current use of any active systemic medication for chronic atopic dermatitis within one month

The above is a clinical trial exclusion criterion. Annotated with entity spans:
Current use of any [Temporal: active] [Drug: systemic medication] for [Condition: chronic atopic dermatitis] [Temporal: within one month]